Women who are pregnant or breastfeeding (pregnancy defined as the state of a female after conception until the termination of gestation, confirmed by a positive human chorionic gonadotropin laboratory test (> 5mIU/mL)

The above is a clinical trial exclusion criterion. Annotated with entity spans:
[Person: Women] who are [Condition: pregnant] or [Observation: breastfeeding] (pregnancy defined as the state of a female after conception until the termination of gestation, confirmed by a [Value: positive] [Procedure: human chorionic gonadotropin laboratory test] ([Value: > 5mIU/mL])